下列心臟疾病之女性病患由於懷孕生產之危險性極高，應建議不要懷孕，但何種女性除外？
A. 有厲害之肺高壓
B. 有厲害之主動脈瓣狹窄
C. 有 Marfan 症候群且主動脈根部大於 40 mm
D. 曾接受過開心手術之法洛氏四重症

正確答案：D. 曾接受過開心手術之法洛氏四重症